下列何者不是更年期婦女血液荷爾蒙之參考檢查？
A. 雌二醇（Estradiol）
B. 促濾泡激素（FSH）
C. 促黃體激素（LH）
D. Androstenedione

正確答案：D. Androstenedione